下列有關披衣菌（Chlamydiaceae）的實驗診斷之敘述，何者錯誤？
A. 由感染部位採集到的膿，是最適當的檢體
B. 只有細胞培養（cell culture）法能用以分離此類細菌
C. 血清學試驗不易區分現在或過去的感染
D. 偵測其脂多醣體（lipopolysaccharide）的免疫螢光染色法，專一性較差

正確答案：A. 由感染部位採集到的膿，是最適當的檢體